Teeth with clinical symptoms of irriversible pulpitis or pulp necrosis or acute dental infection

The above is a clinical trial exclusion criterion. Annotated with entity spans:
[Qualifier: Teeth] with clinical symptoms of [Condition: irriversible pulpitis] or [Condition: pulp necrosis] or [Condition: acute dental infection]